5. Volunteers must be willing to complete all study-related activities

The above is a clinical trial inclusion criterion. Annotated with entity spans:
[Parsing_Error: 5.] [Post-eligibility: Volunteers must be willing to complete all study-related activities]